Clinical trial exclusion criterion:
Partial mole

Annotated entities:
- Condition: "Partial mole"